Clinical trial inclusion criteria:
Localized intermediate-risk or high-risk prostate cancer cT3
Gleason score = 7 (3+4 and/or 4+3) and/or
PSA = 20 ng/ml
intact preoperative erectile function with an IIEF = 21 (IIEF-6).

Annotated entities:
- Qualifier: "high-risk"
- Qualifier: "cT3"
- Qualifier: "intermediate-risk"
- Condition: "prostate cancer"
- Measurement: "Gleason score"
- Value: "= 7"
- Value: "3+4"
- Value: "4+3"
- Measurement: "PSA"
- Value: "= 20 ng/ml"
- Condition: "intact erectile function"
- Temporal: "preoperative"
- Measurement: "IIEF"
- Value: "= 21"
- Observation: "IIEF-6"